Clinical trial inclusion criterion:
Patients willing to sign his/her consent.

Annotated entities:
- Informed_consent: "Patients willing to sign his/her consent"